Previous participation in this study

The above is a clinical trial exclusion criterion. Annotated with entity spans:
[Competing_trial: Previous participation in this study]